No known allergy to Bupivacaine.

The above is a clinical trial inclusion criterion. Annotated with entity spans:
[Negation: No] known [Condition: allergy] to [Drug: Bupivacaine].